干擾素（interferon）是身體對病毒感染之防衛系統之一環，其作用機轉為：
A. 直接結合病毒，使其不活化病毒
B. 活化補充素（complements）
C. 結合在細胞表面，阻止病毒侵入
D. 引誘細胞合成各種不同酵素，可分解病毒 RNA 或阻止病毒蛋白質的合成

正確答案：D. 引誘細胞合成各種不同酵素，可分解病毒 RNA 或阻止病毒蛋白質的合成